Clinical trial exclusion criterion:
esmolol administration in the previous 30 days

Annotated entities:
- Drug: "esmolol"
- Temporal: "in the previous 30 days"